Clinical trial exclusion criteria:
Current or chronic history of liver disease, or known hepatic or biliary abnormalities (with the exception of Gilbert's syndrome or asymptomatic gallstones).
History of regular alcohol consumption within 6 months of the study defined as: An average weekly intake of >21 units for males or >14 units for females. One unit is equivalent to 8 gram of alcohol: a half-pint (approximately 240 milliliter [mL]) of beer, 1 glass (100 mL) of wine or 1 (25 mL) measure of spirits.
History of sensitivity to heparin or heparin-induced thrombocytopenia.
History of sensitivity to any of the study medications, or components thereof or a history of drug or other allergy that, in the opinion of the investigator or GSK Medical Monitor, contraindicates their participation.
Gastrointestinal disease or with gastrointestinal surgical history which can affect the absorption of the investigational product.
A positive pre-study Hepatitis B surface antigen or positive Hepatitis C antibody result within 3 months of screening
Urinary cotinine levels indicative of smoking or history or regular use of tobacco- or nicotine-containing products within 6 months prior to screening.
A positive pre-study drug/alcohol screen.
A positive test for Human Immunodeficiency Virus (HIV) antibody.
Pregnant females as determined by positive serum hCG test at screening or prior to dosing.
Where participation in the study would result in donation of blood or blood products in excess of 500 mL within a 90 day period.
Lactating females.
The subject has participated in a clinical trial and has received an investigational product within the following time period prior to the first dosing day in the current study: 90 days, 5 half-lives or twice the duration of the biological effect of the investigational product (whichever is longer).
Exposure to more than four new chemical entities within 12 months prior to the first dosing day.

Annotated entities:
- Temporal: "Current"
- Temporal: "chronic"
- Temporal: "history"
- Condition: "liver disease"
- Condition: "biliary abnormalities"
- Condition: "hepatic abnormalities"
- Condition: "Gilbert's syndrome"
- Negation: "exception"
- Condition: "gallstones"
- Qualifier: "asymptomatic"
- Condition: "regular alcohol consumption"
- Temporal: "History"
- Temporal: "within 6 months of the study"
- Reference_point: "the study"
- Measurement: "average weekly intake"
- Value: ">21 units"
- Person: "males"
- Value: ">14 units"
- Person: "females"
- Parsing_Error: "One unit is equivalent to 8 gram of alcohol: a half-pint (approximately 240 milliliter [mL]) of beer, 1 glass (100 mL) of wine or 1 (25 mL) measure of spirits."
- Condition: "sensitivity to heparin"
- Drug: "heparin"
- Condition: "heparin-induced thrombocytopenia"
- Qualifier: "heparin-induced"
- Drug: "heparin"
- Drug: "study medications"
- Context_Error: "study medications"
- Condition: "sensitivity to any of the study medications"
- Context_Error: "sensitivity to any of the study medications"
- Temporal: "History"
- Condition: "drug allergy"
- Condition: "allergy"
- Subjective_judgement: "in the opinion of the investigator or GSK Medical Monitor"
- Undefined_semantics: "contraindicates their participation"
- Subjective_judgement: "contraindicates their participation"
- Condition: "Gastrointestinal disease"
- Temporal: "gastrointestinal surgical history"
- Procedure: "gastrointestinal surgical"
- Qualifier: "affect the absorption of the investigational product"
- Context_Error: "affect the absorption of the investigational product"
- Undefined_semantics: "affect the absorption of the investigational product"
- Measurement: "Hepatitis B surface antigen"
- Value: "positive"
- Temporal: "pre-study"
- Measurement: "Hepatitis C antibody"
- Value: "positive"
- Temporal: "within 3 months of screening"
- Reference_point: "screening"
- Grammar_Error: "cotinine"
- Measurement: "Urinary cotinine levels"
- Condition: "smoking"
- Condition: "regular use of tobacco"
- Temporal: "history"
- Condition: "regular use of nicotine-containing products"
- Temporal: "within 6 months prior to screening"
- Reference_point: "screening"
- Temporal: "pre-study"
- Measurement: "drug screen"
- Measurement: "alcohol screen"
- Value: "positive"
- Measurement: "Human Immunodeficiency Virus (HIV) antibody"
- Value: "positive"
- Condition: "Pregnant"
- Person: "females"
- Measurement: "serum hCG test"
- Value: "positive"
- Temporal: "at screening"
- Temporal: "prior to dosing"
- Reference_point: "screening"
- Reference_point: "dosing"
- Non-query-able: "Where participation in the study would result in donation of blood or blood products in excess of 500 mL within a 90 day period."
- Undefined_semantics: "Where participation in the study would result in donation of blood or blood products in excess of 500 mL within a 90 day period."
- Context_Error: "Where participation in the study would result in donation of blood or blood products in excess of 500 mL within a 90 day period."
- Person: "females"
- Condition: "Lactating"
- Undefined_semantics: "The subject has participated in a clinical trial and has received an investigational product within the following time period prior to the first dosing day in the current study: 90 days, 5 half-lives or twice the duration of the biological effect of the investigational product (whichever is longer)."
- Post-eligibility: "The subject has participated in a clinical trial and has received an investigational product within the following time period prior to the first dosing day in the current study: 90 days, 5 half-lives or twice the duration of the biological effect of the investigational product (whichever is longer)."
- Multiplier: "more than four"
- Drug: "new chemical entities"
- Undefined_semantics: "new chemical entities"
- Temporal: "within 12 months prior to the first dosing day"
- Reference_point: "the first dosing day"